呂小姐 28 歲於浴室中滑倒，右上肢被洗臉盆碎片割傷多處，經送醫縫合處置後回家休養，數週後仍覺不適至門診就診，主訴右手小指及無名指的一半麻木，感覺遲鈍，且外觀呈曲屈狀。呂小姐的最適當診斷為：
A. 正中神經損傷
B. 橈神經損傷
C. 尺神經損傷
D. 前骨間神經損傷

正確答案：C. 尺神經損傷